Clinical trial exclusion criterion:
Other CNS conditions: non-opportunistic primary or metastatic brain tumors, uncontrolled seizure disorder, progressive multiple sclerosis, stroke with neurological sequelae, or dementia due to causes other than HIV (eg, Alzheimer's disease)

Entity relations:
- Has_qualifier("CNS conditions", "Other")
- Has_qualifier("brain tumors", "primary")
- Has_qualifier("brain tumors", "non-opportunistic")
- Has_qualifier("seizure disorder", "uncontrolled")
- Has_negation("HIV", "other than")
- Subsumes("HIV", "Alzheimer's disease")
- AND("dementia", "HIV")
- AND("stroke", "neurological sequelae")
- Subsumes("CNS conditions", "brain tumors")
- OR("primary", "metastatic")
- OR("brain tumors", "stroke", "progressive multiple sclerosis", "seizure disorder", "dementia")